Clinical trial inclusion criterion:
2. diagnosis of moderate to severe AT, confirmed by Dr. Wilson using clinical symptoms and exam findings consistent with chronic AT (>6 month duration) - which includes pain while palpating the intratendinous swelling part of the Achilles tendon and relief of pain when tendon placed under tension - and pre-procedure US

Entity relations:
- Has_qualifier("AT", "moderate to severe")
- Has_temporal("chronic AT", ">6 month duration")